Clinical trial exclusion criterion:
lack of fluency in English

Annotated entities:
- Non-query-able: "lack of fluency in English"